Clinical trial exclusion criterion:
cancer as the reason for intestinal failure

Entity relations:
- AND("cancer", "intestinal failure")